Clinical trial exclusion criterion:
Feeding tube

Annotated entities:
- Device: "Feeding tube"